Clinical trial exclusion criterion:
Subject has thrombocytosis (platelet count > 600,000 / µl) or thrombocytopenia (platelet count <100,000 / µl).

Annotated entities:
- Condition: "thrombocytosis"
- Measurement: "platelet count"
- Value: "> 600,000 / µl"
- Condition: "thrombocytopenia"
- Measurement: "platelet count"
- Value: "<100,000 / µl"